Signed informed consent by patient, legal representative or authorized person or deferred consent

The above is a clinical trial inclusion criterion. Annotated with entity spans:
[Post-eligibility: Signed informed consent by patient, legal representative or authorized person or deferred consent]